FEV1 30 - 79% of predicted and FEV1/FVC < 70% (GOLD 2-3)

The above is a clinical trial inclusion criterion. Annotated with entity spans:
[Measurement: FEV1] [Value: 30 - 79% of predicted] and [Measurement: FEV1/FVC] [Value: < 70%] ([Measurement: GOLD] [Value: 2-3])